有關乳房超音波檢查之敘述，下列何者錯誤？
A. 乳房簡單性水瘤（simple cyst）在超音波檢查呈現，邊緣平滑，內在無音波（echo-free）
B. 乳房超音波可以做為篩檢的工具，效果比乳房 X 光攝影佳，且可降低更多的死亡率
C. 乳房超音波針對小於 1 公分病灶不易區別良惡性
D. 乳癌於乳房超音波影像常呈現邊緣不規則，但外形整齊者亦常見

正確答案：B. 乳房超音波可以做為篩檢的工具，效果比乳房 X 光攝影佳，且可降低更多的死亡率